Clinical trial exclusion criterion:
Use of an investigational drug within 30 days of randomization, or within 5 half-lives of the investigational drug (the longer period will apply)

Annotated entities:
- Drug: "investigational drug"
- Temporal: "within 30 days of randomization"
- Reference_point: "randomization"
- Temporal: "within 5 half-lives of the investigational drug"
- Drug: "investigational drug"